關於甲狀腺素（Thyroid hormones）之敘述，下列何者錯誤？
A. 主要藉由血液中結合蛋白（Binding protein）運送至標的細胞（Target cell）作用
B. 游離型（Free-form）激素主要藉由結合至位於標的細胞細胞膜上之受體（Receptor），進行生理調節作用
C. 血中半衰期較一般胜肽類（Peptide）激素為長
D. 可調控標的基因之轉錄（Transcription）

正確答案：B. 游離型（Free-form）激素主要藉由結合至位於標的細胞細胞膜上之受體（Receptor），進行生理調節作用